History of craniectomy or significant skull defect (contraindication to Optune).

The above is a clinical trial exclusion criterion. Annotated with entity spans:
History of [Procedure: craniectomy] or [Qualifier: significant] [Condition: skull defect] ([Condition: contraindication] to [Device: Optune]).